How is ZP-PTH delivered to patients?

ZP-PTH uses a  transdermal drug-coated microneedle patch system.